Which member of the human mycobiota is associated to atherosclerosis?

Mucor racemosus is negatively associated with carotid atherosclerosis